Clinical trial exclusion criterion:
Any prior serious adverse reaction or hypersensitivity to fentanyl, morphine, codeine, hydrocodone, hydromorphone, oxycodone, oxymorphone, naltrexone or naloxone or any of the inactive ingredients in the TDDS (polyester/ethyl vinyl acetate, polyacrylate adhesive, silicone adhesive, dimethicone NF, or polyolefin)

Annotated entities:
- Condition: "hypersensitivity"
- Drug: "fentanyl"
- Drug: "morphine"
- Drug: "codeine"
- Drug: "hydrocodone"
- Drug: "hydromorphone"
- Drug: "oxycodone"
- Drug: "oxymorphone"
- Drug: "naltrexone"
- Drug: "naloxone"
- Device: "TDDS"
- Device: "polyester/ethyl vinyl acetate"
- Device: "polyacrylate adhesive"
- Device: "silicone adhesive"
- Device: "dimethicone NF"
- Device: "polyolefin"